下列何者的起點及終點，都在中軸骨骼上？
A. 胸大肌（pectoralis major）
B. 胸小肌（pectoralis minor）
C. 前鋸肌（serratus anterior）
D. 後鋸肌（serratus posterior）

正確答案：D. 後鋸肌（serratus posterior）